Clinical trial inclusion criterion:
oral anticoagulation that cannot be safely discontinued for the duration of the study

Entity relations:
- Has_index("for the duration of the study", "the study")
- Has_qualifier("oral anticoagulation", "cannot be safely discontinued")
- Has_temporal("oral anticoagulation", "for the duration of the study")